活化下列何種位於運動終板（motor end plate）上的受器，可啟動骨骼肌細胞的動作電位（action  potential）？
A. nicotinic receptor
B. muscarinic receptor
C. dihydropyridine receptor
D. ryanodine receptor

正確答案：A. nicotinic receptor